肱骨外上髁炎（humeral lateral epicondylitis）與下列那一條肌肉過度使用最不相關？
A. 肱橈肌（brachioradialis）
B. 橈側伸腕肌（extensor carpi radialis）
C. 尺側伸腕肌（extensor carpi ulnaris）
D. 伸指總肌（extensor digitorum）

正確答案：A. 肱橈肌（brachioradialis）